一位 40 歲女性美籍白人，過去健康狀況良好，至泰國觀光第三天開始腹瀉二天，並合併發燒，則她最可能之致病菌為：
A. 梨形蟲（Giardia）
B. 阿米巴（Ameba）
C. 沙門氏菌（Salmonella）
D. 大腸桿菌（Escherichia coli）

正確答案：D. 大腸桿菌（Escherichia coli）